Patient should be clearly conscious, fully understand and able to answer questionnaire

The above is a clinical trial inclusion criterion. Annotated with entity spans:
[Post-eligibility: Patient should be clearly conscious, fully understand and able to answer questionnaire]